Clinical trial inclusion criterion:
Patients suffering from chronic heart failure (the heart failure diagnosis must have been made or confirmed by a cardiologist and/or hospital physician at any time in the patient's medical history).

Annotated entities:
- Condition: "chronic heart failure"